Clinical trial inclusion criterion:
Postmenopausal state revealed by:

Annotated entities:
- Condition: "Postmenopausal state"
- Parsing_Error: "Postmenopausal state revealed by:"